Atiende a una mujer de 48 años, en situación premenopáusica que practica deporte regularmente y no es fumadora. Presenta una fractura vertebral en T11 considerada fractura por fragilidad. Señale la respuesta correcta:
1. No es necesario iniciar un tratamiento antirreabsortivo por edad y ausencia de otros factores de riesgo.
2. Recomendaría orientar su dieta a fortalecer el consumo de productos ricos en calcio y fósforo.
3. Debe iniciar tratamiento con un agente antirreabsortivo asociado a suplementos de calcio y vitamina D.
4. No debe instaurarse ningún tratamiento farmacológico hasta disponer de los resultados de una densitometría ósea lumbar y femoral.

Respuesta correcta: 3. Debe iniciar tratamiento con un agente antirreabsortivo asociado a suplementos de calcio y vitamina D.